Clinical trial exclusion criterion:
Any physical or intellectual disability adversely affecting ability to complete assessments

Entity relations:
- OR("physical disability", "intellectual disability")